Clinical trial exclusion criterion:
Patient is unable to take warfarin or other oral anti-coagulant medication.

Annotated entities:
- Mood: "unable to take"
- Drug: "warfarin"
- Drug: "oral anti-coagulant medication"